造成兔熱病（tularemia）的病菌具有下列那種特徵？
A. 會產生芽孢（spores）
B. 是一種微嗜氧菌（microaerophil）
C. 能在巨噬細胞（macrophages）內存活
D. 常由胃腸道感染人體

正確答案：C. 能在巨噬細胞（macrophages）內存活